Clinical trial exclusion criterion:
Known to be human immunodeficiency virus positive

Annotated entities:
- Condition: "human immunodeficiency virus positive"
- Measurement: "human immunodeficiency virus"
- Value: "positive"